unprotected sex (in past 6 months) with 1 or more men of unknown HIV status

The above is a clinical trial inclusion criterion. Annotated with entity spans:
[Observation: unprotected sex] ([Temporal: in past 6 months]) with [Multiplier: 1 or more] [Person: men of unknown HIV status]